Clinical trial exclusion criterion:
Treatment within the past 4 days with an antibiotic that may be effective against typhoid fever

Annotated entities:
- Temporal: "within the past 4 days"
- Drug: "antibiotic"
- Qualifier: "effective against typhoid fever"
- Condition: "typhoid fever"